Clinical trial inclusion criterion:
Positive anti-dsDNA.

Annotated entities:
- Measurement: "anti-dsDNA"
- Value: "Positive"